Clinical trial exclusion criterion:
Spontaneous labor (latent or active phase)

Annotated entities:
- Condition: "Spontaneous labor"
- Qualifier: "latent phase"
- Qualifier: "active phase"